Clinical trial exclusion criterion:
Primary groups: Vaccination against typhoid fever within 5 years before dosing.

Annotated entities:
- Observation: "Primary groups"
- Procedure: "Vaccination against typhoid fever"
- Condition: "typhoid fever"
- Temporal: "within 5 years before dosing"
- Reference_point: "dosing"